Clinical trial inclusion criterion:
admitted for living donor renal transplantation.

Entity relations:
- Has_mood("living donor renal transplantation", "admitted for")